Clinical trial inclusion criterion:
Woman signing the consent form for at least the blood sample

Annotated entities:
- Post-eligibility: "Woman signing the consent form for at least the blood sample"